Clinical trial exclusion criterion:
Myocardial infarction

Annotated entities:
- Condition: "Myocardial infarction"